El yodo es poco soluble en agua ( 0.001M). Por ello, para obtener disoluciones útiles como reactivo analítico se disuelve en:
1. Nitrato potásico 0.1 M.
2. Ácido perclórico 0.01 M.
3. Exceso de nitrato cálcico.
4. Yoduro potásico.
5. Agua caliente.

Respuesta correcta: 4. Yoduro potásico.